Clinical trial inclusion criterion:
elective Laparoscopic myomectomy patients 24hr post-operative patient controlled analgesia analgesia no mild or severe liver or renal disfunction

Annotated entities:
- Qualifier: "Laparoscopic"
- Procedure: "myomectomy"
- Qualifier: "elective"
- Line: "elective Laparoscopic myomectomy patients"
- Line: "24hr post-operative"
- Line: "patient controlled analgesia analgesia"
- Line: "no mild or severe liver or renal disfunction"
- Temporal: "24hr post-operative"
- Procedure: "patient controlled analgesia"
- Non-representable: "analgesia"
- Negation: "no"
- Qualifier: "mild"
- Qualifier: "severe"
- Condition: "renal disfunction"
- Condition: "liver disfunction"